Clinical trial inclusion criterion:
The parent/guardian must be willing and capable of providing permission for their child to participate through the written informed consent process

Annotated entities:
- Informed_consent: "The parent/guardian must be willing and capable of providing permission for their child to participate through the written informed consent process"